Lifetime history of Bipolar Disorder, Dementia, Autism Spectrum Disorder, Schizophrenia, or any other Psychotic Disorder.

The above is a clinical trial exclusion criterion. Annotated with entity spans:
Lifetime history of [Condition: Bipolar Disorder], [Condition: Dementia], [Condition: Autism Spectrum Disorder], [Condition: Schizophrenia], or any other [Condition: Psychotic Disorder].